Clinically significant cardiac arrhythmia or other cardiac disease (including congestive heart failure), uncontrolled diabetes mellitus, clinically significant respiratory disease, or known immunosuppression

The above is a clinical trial exclusion criterion. Annotated with entity spans:
Clinically significant [Condition: cardiac arrhythmia] or other [Condition: cardiac disease] (including [Condition: congestive heart failure]), [Qualifier: uncontrolled] [Condition: diabetes mellitus], [Qualifier: clinically significant] [Condition: respiratory disease], or known [Condition: immunosuppression]